關於社交焦慮症（social anxiety disorder (social phobia)）的描述下列何者錯誤？
A. 個案主要是害怕他人批評或評價的眼光
B. 常伴隨逃避人群及社交場合的行為
C. 個案認為這種對社交的害怕是過度或不合理的
D. 通常初次發生於成人早期

正確答案：D. 通常初次發生於成人早期